Medical history of chronic psychiatric disease

The above is a clinical trial exclusion criterion. Annotated with entity spans:
Medical [Temporal: history] of [Condition: chronic psychiatric disease]